A compromised lung on the contralateral side of the block (Pneumothorax, hemothorax or Pneumonectomy).

The above is a clinical trial exclusion criterion. Annotated with entity spans:
A [Condition: compromised lung] on the [Qualifier: contralateral side of the block] ([Condition: Pneumothorax], [Condition: hemothorax] or [Condition: Pneumonectomy]).